Clinically significant hepatic or renal disorder.

The above is a clinical trial exclusion criterion. Annotated with entity spans:
[Qualifier: Clinically significant] [Condition: hepatic] or [Condition: renal disorder].